Clinical trial exclusion criterion:
history of bleeding peptic ulcer

Annotated entities:
- Condition: "peptic ulcer"
- Condition: "bleeding"